Patient with a chronic pain condition, major unexpected surgical complication, unexpected prolonged intubation, patient refusal, local anesthetic allergy, any contraindication to regional anesthesia, greater than 2 attempts by resident and greater than 1 attempt by staff anesthesiologist for TAP block.

The above is a clinical trial exclusion criterion. Annotated with entity spans:
Patient with a [Condition: chronic pain condition], [Qualifier: major] [Condition: unexpected surgical complication], [Qualifier: unexpected] [Multiplier: prolonged] [Procedure: intubation], [Observation: patient refusal], [Drug: local anesthetic] [Condition: allergy], any [Condition: contraindication] to [Drug: regional anesthesia], [Multiplier: greater than 2] attempts by [Person: resident] and [Multiplier: greater than 1] attempt by staff [Person: anesthesiologist] for [Procedure: TAP block].